林先生已經知道自己感染人類免疫缺乏病毒（HIV），於就醫時是否有義務應該向醫事人員告知其已感染 HIV？
A. 是，依據相關法律的規定，林先生就醫時，應向醫事人員告知其已感染 HIV
B. 是，雖然法律沒有相關規定，但基於醫護人員的安全考量，林先生就醫時，應向醫事人員告知其已感染 HIV
C. 否，基於病患的自主權，病患有權利可以拒絕告知醫事人員其已感染 HIV 的事實
D. 否，為了避免就醫過程中所可能遭受的歧視，病患沒有義務要向醫事人員告知其已感染 HIV 的狀態

正確答案：A. 是，依據相關法律的規定，林先生就醫時，應向醫事人員告知其已感染 HIV